Clinical trial exclusion criterion:
The receipt of any investigational product within 3 months prior to this trial

Entity relations:
- Has_temporal("investigational product", "within 3 months prior to this trial")
- multi("within 3 months prior to this trial", "this trial")